Severe pelvic organ prolapse or prolapse to any degree that may prevent retention of the vaginal ring after insertion

The above is a clinical trial exclusion criterion. Annotated with entity spans:
[Qualifier: Severe] [Condition: pelvic organ prolapse] or [Condition: prolapse] to any degree that [Qualifier: may prevent retention of the vaginal ring after insertion]